4. All subjects should be judged normal and healthy during a pre-study medical evaluation (physical examination, laboratory evaluation, 12-lead ECG, hepatitis B and hepatitis C tests, HIV test, and urine drug screen including amphetamine, barbiturates, benzodiazepine, cannabinoid, cocaine, opiates, phencyclidine, and methadone) performed within 14 days of the initial dose of study medication.

The above is a clinical trial inclusion criterion. Annotated with entity spans:
4. All subjects should be judged [Condition: normal] and [Condition: healthy] during a [Procedure: pre-study medical evaluation] ([Procedure: physical examination], [Procedure: laboratory evaluation], [Procedure: 12-lead ECG], [Procedure: hepatitis B] and [Procedure: hepatitis C tests], [Procedure: HIV test], and [Procedure: urine drug screen] including [Qualifier: amphetamine], [Qualifier: barbiturates], [Qualifier: benzodiazepine], [Qualifier: cannabinoid], [Qualifier: cocaine], [Qualifier: opiates], [Qualifier: phencyclidine], and [Qualifier: methadone]) performed [Temporal: within 14 days of the initial dose of study medication].